Clinical trial exclusion criterion:
Emergent re intervention

Annotated entities:
- Procedure: "re intervention"
- Qualifier: "Emergent"